Clinical trial exclusion criterion:
NSTE-ACS with cardiogenic shock warranting emergent salvage surgery within 12 hrs from hospital admission

Entity relations:
- Has_mood("salvage surgery", "warranting")
- Has_index("within 12 hrs from hospital admission", "hospital admission")
- AND("NSTE-ACS", "salvage surgery")
- Has_temporal("NSTE-ACS", "within 12 hrs from hospital admission")
- AND("cardiogenic shock", "salvage surgery")
- Has_temporal("cardiogenic shock", "within 12 hrs from hospital admission")